Participant has received a community available influenza vaccine within <6 months

The above is a clinical trial exclusion criterion. Annotated with entity spans:
Participant has received a community available [Procedure: influenza vaccine] [Temporal: within <6 months]